下列關於戊糖磷酸途徑（pentose phosphate pathway）的敘述，何者錯誤？
A. 產生NADPH供還原反應使用
B. 產物可轉換成ribose-5-phosphate供核苷酸合成使用
C. 反應中glucose-6-phosphate dehydrogenase缺乏會導致蠶豆症的發生
D. 該反應速率限制酵素（rate limiting enzyme）為6-phospho-gluco-lactonase

正確答案：D. 該反應速率限制酵素（rate limiting enzyme）為6-phospho-gluco-lactonase